Patients presenting for CMR with the clinical diagnosis of hypertrophic cardiomyopathy based on left ventricular wall thickness of at least =15 mm in the absence of any other cardiac or systemic cause of hypertrophy

The above is a clinical trial inclusion criterion. Annotated with entity spans:
Patients presenting for CMR with the clinical diagnosis of [Condition: hypertrophic cardiomyopathy] based on [Measurement: left ventricular wall thickness] of [Value: at least =15 mm] in the [Negation: absence] of any other [Condition: cardiac] or [Condition: systemic cause of hypertrophy]